Clinical trial exclusion criterion:
Patients with allergies or contraindications to study medications

Annotated entities:
- Condition: "allergies"
- Condition: "contraindications"
- Drug: "study medications"